Aspartate transaminase 又可稱為 Glutamate:oxaloacetate transaminase 作用時需要下列何者當作輔助因子？
A. pyridoxal phosphate
B. thiamine
C. FAD
D. ATP

正確答案：A. pyridoxal phosphate